Las enzimas de restricción:
1. Son ribonucleasas específicas que degradan RNA después de su síntesis.
2. Son endonucleasas que reconocen secuencias específicas.
3. Catalizan la adición de ciertos aminoácidos a los tRNA.
4. Actúan en la membrana celular para restringir el paso de sustancias.

Respuesta correcta: 2. Son endonucleasas que reconocen secuencias específicas.